Non-infectious or autoimmune keratitis

The above is a clinical trial exclusion criterion. Annotated with entity spans:
[Condition: Non-infectious] or [Condition: autoimmune keratitis]